Clinical trial exclusion criterion:
Prior use of levothyroxine

Entity relations:
- Has_temporal("levothyroxine", "Prior")